Not received neuraxial anesthesia

The above is a clinical trial exclusion criterion. Annotated with entity spans:
[Negation: Not received] [Procedure: neuraxial anesthesia]